Clinical trial exclusion criterion:
Emergency surgery needed

Annotated entities:
- Procedure: "Emergency surgery"
- Mood: "needed"